Clinical trial exclusion criterion:
Recent (within 6 weeks) or planned dental or jaw surgery (e.g. extraction, implants)

Annotated entities:
- Temporal: "within 6 weeks"
- Temporal: "Recent"
- Mood: "planned"
- Procedure: "dental surgery"
- Procedure: "jaw surgery"
- Procedure: "extraction"
- Procedure: "implants"